關於testicular tumor之敘述，下列何者錯誤？
A. 以germ cell tumor為主，約占90～95%的primary testicular tumor
B. 隱睪症患側常見之睪丸癌為精原細胞癌（seminoma）
C. 治療前先做切片確定診斷
D. 多數睪丸腫瘤經淋巴轉移，且匯集至腎門附近的淋巴結

正確答案：C. 治療前先做切片確定診斷